<18 years of age

The above is a clinical trial exclusion criterion. Annotated with entity spans:
[Value: <18 years] of [Person: age]